Clinical trial exclusion criterion:
Treatment with glucocorticoids

Entity relations:
- AND("Treatment", "glucocorticoids")